Evidence of another diagnosis that can explain serous SRF or visual loss;

The above is a clinical trial exclusion criterion. Annotated with entity spans:
[Non-representable: Evidence of another diagnosis that can explain serous SRF or visual loss;]